16. Concomitant administration of any food product known to alter P450 enzyme or P-gp activity such as grapefruit juice, Seville oranges

The above is a clinical trial exclusion criterion. Annotated with entity spans:
[Parsing_Error: 16.] [Temporal: Concomitant] administration of any [Undefined_semantics: food product known to alter P450 enzyme or P-gp activity] such as [Drug: grapefruit juice], [Drug: Seville oranges]